Clinical trial exclusion criterion:
Injuries to or operations on the central nervous system, eyes and ears within the last 2 months.

Entity relations:
- Has_qualifier("Injuries", "central nervous system")
- Has_temporal("Injuries", "last 2 months")
- OR("central nervous system", "eyes", "ears")
- OR("Injuries", "operations")